Clinical trial exclusion criterion:
Any history of allergic reaction to local anesthetics, gastrointestinal bleeding or ulceration;

Entity relations:
- AND("allergic reaction", "local anesthetics")
- Has_temporal("allergic reaction", "history")
- OR("allergic reaction", "gastrointestinal ulceration", "gastrointestinal bleeding")